下列何種血液性疾病主要的特徵是骨髓造血功能旺盛，造成骨髓明顯擴張？
A. 地中海貧血（thalassemia）
B. 再生不良性貧血（aplastic anemia）
C. 免疫性血小板缺乏紫斑症（immune thrombocytopenic purpura）
D. 急性骨髓性白血病（acute myelogenous leukemia）

正確答案：A. 地中海貧血（thalassemia）